甲狀腺乳突癌或濾泡癌在接受全甲狀腺切除術後，可利用下列何項來偵測復發或轉移？
A. CEA
B. 抑鈣素（calcitonin）
C. 甲狀腺球蛋白（thyroglobulin）
D. TSH-receptor Ab

正確答案：C. 甲狀腺球蛋白（thyroglobulin）